Clinical trial exclusion criterion:
Currently taking any psychotropic medications

Annotated entities:
- Drug: "psychotropic medications"
- Temporal: "Currently"